Clinical trial exclusion criterion:
Patients with resorbable upper face fillers injection in the past 12 months

Annotated entities:
- Temporal: "in the past 12 months"
- Procedure: "resorbable fillers injection"
- Qualifier: "upper face"